Male or female between, and including, 6-12 weeks (42 to 90 days) of age at the time of the first vaccination.

The above is a clinical trial inclusion criterion. Annotated with entity spans:
Male or female [Value: between], and including, 6-12 weeks (42 to 90 days) [Person: of age] [Temporal: at the time of the first vaccination].